Clinical trial exclusion criterion:
Patient obtaining care in relation to a recently completed pregnancy (delivery, spontaneous or elective abortion)

Annotated entities:
- Non-query-able: "Patient obtaining care in relation to a recently completed pregnancy (delivery, spontaneous or elective abortion)"